Clinical trial inclusion criterion:
Men or women at least 19 years of age

Annotated entities:
- Person: "Men"
- Person: "women"
- Value: "at least 19 years"
- Person: "age"